Clinical trial exclusion criterion:
score level D on the SIGAM mobility grade

Annotated entities:
- Measurement: "SIGAM mobility grade"
- Value: "level D"